Immature teratoma 的預後與下列何者有關？
A. 有 mature teratoma 之存在
B. 其 glandular differentiation 之程度
C. 未分化神經組織量的多寡
D. 腫瘤中脂肪量之多寡

正確答案：C. 未分化神經組織量的多寡